1. HIV infection with plasma and CSF HIV RNA concentrations (using Roche Amplicor assay) > 1,000 copies/ mL (available after baseline LP).

The above is a clinical trial inclusion criterion. Annotated with entity spans:
1. [Condition: HIV infection] with [Measurement: plasma] and [Measurement: CSF HIV RNA concentration]s (using [Procedure: Roche Amplicor assay]) [Value: > 1,000 copies/ mL] (available after baseline LP).